Clinical trial inclusion criterion:
HBV DNA < 200 IU/ml during nucleos(t)ide analogue (except Telbivudine) treatment within one month prior to initiation of peginterferon alfa-2a

Annotated entities:
- Measurement: "HBV DNA"
- Value: "< 200 IU/ml"
- Temporal: "within one month prior to initiation of peginterferon alfa-2a"
- Reference_point: "initiation of peginterferon alfa-2a"
- Drug: "peginterferon alfa-2a"
- Drug: "nucleos(t)ide analogue"
- Drug: "Telbivudine"
- Negation: "except"
- Temporal: "during nucleos(t)ide analogue (except Telbivudine) treatment"
- Reference_point: "nucleos(t)ide analogue (except Telbivudine) treatment"